Clinical trial inclusion criterion:
The patient has no child bearing potential

Annotated entities:
- Condition: "child bearing potential"
- Negation: "no"